Patient enrolled in the study within the past 72 hours

The above is a clinical trial exclusion criterion. Annotated with entity spans:
Patient [Observation: enrolled in the study] [Temporal: within the past 72 hours]